Myocardial infarction within the previous 6 months

The above is a clinical trial exclusion criterion. Annotated with entity spans:
[Condition: Myocardial infarction] [Temporal: within the previous 6 months]